Clinical trial exclusion criterion:
History of genetically inherited progressive CNS degenerative disorder (e.g., hereditary paraparesis; MELAS [mitochondrial myopathy, encephalopathy, lactic acidosis, stroke] syndrome)

Annotated entities:
- Condition: "progressive CNS degenerative disorder"
- Qualifier: "genetically inherited"
- Condition: "hereditary paraparesis"
- Condition: "mitochondrial myopathy"
- Condition: "encephalopathy"
- Condition: "lactic acidosis"
- Condition: "stroke"
- Condition: "MELAS syndrome"